¿Cuándo se fundó la primera Escuela de Enfermeras de España?
1. En 1857, en Madrid, en el Hospital de la Princesa, por Isabel II.
2. En 1896, en Madrid, en el Instituto de Terapéutica Operatoria “Santa Isabel de Hungría”, por el Dr. Rubio.
3. En 1908, en Madrid, por la Cruz Roja.
4. En 1917, en Madrid, en el Hospital de la Santa Isabel y San Pablo, por el Protomedicato.
5. En 1952, en Madrid, tras la creación de los hospitales de la Seguridad Social.

Respuesta correcta: 2. En 1896, en Madrid, en el Instituto de Terapéutica Operatoria “Santa Isabel de Hungría”, por el Dr. Rubio.